How are deletion breakpoints defined?

We identified 18 deletion breakpoints at the DNA nucleotide sequence level. Specifically, (AT)n, (GAA)n and (GAAA)n constitute the most frequent repeats at translocation breakpoints, whereas A-tracts occur preferentially at deletion breakpoints Commonly used methods for the detection of CNV breakpoints include long-range PCR and primer walking, their success being limited by the deletion size, GC content and presence of DNA repeats. Molecular mapping of deletion breakpoints on chromosome 4 of Drosophila melanogaster.